出現尿蛋白是下列何種血液腫瘤的主要臨床表徵之一？
A. 套膜細胞淋巴癌（mantle cell lymphoma）
B. 濾泡性淋巴癌（follicular lymphoma）
C. 多發性骨髓瘤（multiple myeloma）
D. 結節硬化型何杰金氏淋巴癌（nodular sclerosis Hodgkin lymphoma）

正確答案：C. 多發性骨髓瘤（multiple myeloma）